Previous treatment on this study or with a fibroblast growth factor

The above is a clinical trial exclusion criterion. Annotated with entity spans:
[Temporal: Previous] [Procedure: treatment] on this study or with a [Drug: fibroblast growth factor]